List the cancers that are associated with SBLA syndrome.

SBLA cancer syndrome (sarcoma, breast, leukemia, and adrenal).